Currently receiving treatment with an atypical antipsychotic and continuation on the medication has been recommended

The above is a clinical trial inclusion criterion. Annotated with entity spans:
[Temporal: Currently] receiving [Procedure: treatment] with an [Drug: atypical antipsychotic] and [Procedure: continuation on the medication] has been [Mood: recommended]